El tratamiento psicoterapéutico en los trastornos psicóticos:
1. Es imposible por el grave deterioro de la realidad que sufren los pacientes con este tipo de enfermedad.
2. Está contraindicado.
3. Mejora el curso de la enfermedad, previene las recaídas y mejora las habilidades de afrontamiento y de funcionamiento social y laboral.
4. No tiene en cuenta la intervención familiar, ya que con frecuencia este tipo de trastornos se asocian a familias patológicas.
5. Se refiere al establecimiento de programas de entrenamiento en habilidades sociales.

Respuesta correcta: 3. Mejora el curso de la enfermedad, previene las recaídas y mejora las habilidades de afrontamiento y de funcionamiento social y laboral.